Patients with a value of alpha-fetoprotein >100 ng/mL are excluded, unless stability (less than 10% increase) has been documented over at least the previous 3 months.

The above is a clinical trial exclusion criterion. Annotated with entity spans:
Patients with a value of [Measurement: alpha-fetoprotein] [Value: >100 ng/mL] are excluded, [Negation: unless] [Condition: stability] ([Value: less than 10%] [Measurement: increase]) has been documented over [Temporal: at least the previous 3 months].